一位 22 歲的男性病人主訴右膝關節腫痛已一個多月。最近半年來時常睡至下半夜因下背痠痛而醒來。上星期突然眼痛，視力模糊，被眼科醫師診斷為葡萄膜炎（uveitis）。請問下列那一種檢查對診斷最有幫助？
A. 骨盆腔 X 光
B. 右膝關節 X 光
C. 抽血檢查 RF 及 ANA
D. 右膝關節液的檢查

正確答案：A. 骨盆腔 X 光